Clinical trial exclusion criterion:
LVEF <40% or clinically overt congestive heart failure

Entity relations:
- Has_value("LVEF", "<40%")
- Has_qualifier("congestive heart failure", "clinically overt")
- OR("LVEF", "congestive heart failure")